Clinical trial inclusion criterion:
5. Subject has clinical evidence of ischemic heart disease in terms of a positive functional study, or documented symptoms.

Entity relations:
- Has_context("ischemic heart disease", "clinical evidence")
- Has_value("functional study", "positive")
- AND("ischemic heart disease", "functional study")